Positive serology for HBsAg, HCV or HIV antibodies

The above is a clinical trial exclusion criterion. Annotated with entity spans:
[Value: Positive] serology for [Measurement: HBsAg], [Measurement: HCV] or [Measurement: HIV antibodies]